Clinical trial exclusion criterion:
Subjects who aspartate transaminase/alkaline transaminase (AST/ALT) value is more than three times of the upper limit of the normal range at screening test

Entity relations:
- Has_temporal("aspartate transaminase/alkaline transaminase (AST/ALT)", "at screening test")
- Has_value("aspartate transaminase/alkaline transaminase (AST/ALT)", "more than three times of the upper limit of the normal range")
- Has_index("at screening test", "screening test")